Clinical trial inclusion criterion:
PaO2 > 45 mm Hg on room air

Entity relations:
- Has_qualifier("> 45 mm Hg", "on room air")
- Has_value("PaO2", "> 45 mm Hg")